下列何種設計，最適合研究石綿的暴露與肺癌死亡間之因果關係？
A. 回溯性世代研究（retrospective cohort study）
B. 臨床試驗研究（clinical trial）
C. 橫斷式研究（cross-sectional study）
D. 社區介入研究（community intervention）

正確答案：A. 回溯性世代研究（retrospective cohort study）